¿La vacunación con vacuna antipoliomielítica inactivada genera inmunidad de grupo? (señale la respuesta correcta).
1. Sí .
2. No.
3. Solo cuando se utilizan vacunas          con adjuvantes.
4. Solo frente al virus polio tipo 3.
5. Solo si se administra con vacuna DTP.

Respuesta correcta: 1. Sí .